Los genes de clase I del Complejo Principal de Histocompatibilidad:
1. Son poco numerosos
2. Son muy polimórficos.
3. Expresan sus alelos según exclusión alélica.
4. Se expresan en todas las células del organismo.
5. Codifican glicolípidos.

Respuesta correcta: 2. Son muy polimórficos.